Clinical trial inclusion criterion:
Participants who can undergo contraception in case of being in childbearing period

Annotated entities:
- Pregnancy_considerations: "Participants who can undergo contraception in case of being in childbearing period"